Which chromosome contains the TLR7 locus in the human genome?

The TLR7 locus acts in vivo as a tumor suppressor gene and is located on chromosome X (X chromosome).